¿Qué técnica realizaremos para comprobar si el flujo de sangre a través de la arteria cubital es suficiente para irrigar la mano en caso de oclusión de la arteria radial?:
1. Toma de pulso radial.
2. Toma de pulso cubical.
3. Prueba de Allen.
4. Toma de Tensión Arterial.

Respuesta correcta: 3. Prueba de Allen.